Women who are pregnant will also be excluded from the study by performing 2 point of care urine pregnancy tests ( prior to vaccinations)

The above is a clinical trial exclusion criterion. Annotated with entity spans:
[Person: Women] who are [Condition: pregnant] will also be excluded from the study by performing [Multiplier: 2] [Procedure: point of care urine pregnancy tests] ( [Temporal: prior to vaccinations])